¿Qué papel juega la pendrina en las células tiroideas?:
1. Captación de yoduro desde la sangre.
2. Oxidación de yoduro a yodo.
3. Facilita la salida de yoduro hacia el coloide.
4. Yodación de la tiroglobulina.

Respuesta correcta: 3. Facilita la salida de yoduro hacia el coloide.